The MMR vaccine protects against what 3 viruses?

The MMR vaccine provides immunity to measles, mumps and rubella.